Non-smoking, or smoking no more than 10 cigarettes, or 2 cigars, or 2 pipes per day for at least 3 months prior to selection

The above is a clinical trial inclusion criterion. Annotated with entity spans:
[Negation: Non]-[Condition: smoking], or [Condition: smoking] [Multiplier: no more than 10] [Observation: cigarettes], or 2 [Observation: cigars], or 2 [Observation: pipes] per day [Temporal: for at least 3 months prior to selection]